Clinical trial inclusion criterion:
Maxilla and mandible

Annotated entities:
- Qualifier: "Maxilla"
- Qualifier: "mandible"